Clinical trial inclusion criterion:
Reports drinking a minimum of 5 standard drinks for men or 4 standard drinks for women on at least 4 days per week on average over the past 28 days

Annotated entities:
- Value: "minimum of 5 standard drinks on at least 4 days per week"
- Measurement: "drinking"
- Person: "men"
- Value: "4 standard drinks on at least 4 days per week"
- Person: "women"
- Temporal: "over the past 28 days"